Clinical trial inclusion criteria:
Veteran receiving care within the Veterans Health Administration healthcare system
Age 18 years
Physician diagnosis of chronic heart failure, American Heart Association Stage C-D
LVEF <45%
No change in active cardiac medications for 4 weeks prior to randomization
Ability to provide informed consent
Moderate to severe central or mixed central and obstructive sleep apnea, defined as an apnea-hypopnea index (AHI) 15 events per hour, with a central AHI >5 events/hour

Annotated entities:
- Person: "Veteran"
- Visit: "Veterans Health Administration healthcare system"
- Person: "Age"
- Value: "18 years"
- Condition: "chronic heart failure"
- Measurement: "American Heart Association Stage"
- Value: "C-D"
- Measurement: "LVEF"
- Value: "<45%"
- Negation: "No"
- Qualifier: "change"
- Drug: "cardiac medications"
- Temporal: "for 4 weeks prior to randomization"
- Reference_point: "randomization"
- Informed_consent: "Ability to provide informed consent"
- Condition: "obstructive sleep apnea"
- Condition: "central sleep apnea"
- Condition: "mixed central sleep apnea"
- Qualifier: "severe"
- Qualifier: "Moderate"
- Measurement: "apnea-hypopnea index"
- Measurement: "AHI"
- Value: "15 events per hour,"
- Measurement: "central AHI"
- Value: ">5 events/hour"